有關妄想症（delusional disorder）之敘述，下列何者錯誤？
A. 一般發作年齡從18到90歲都有可能，但平均發作年齡是40歲左右
B. 此類病患除非被家人或法庭強制送醫，否則很少主動尋求醫師協助
C. 社交孤立是此症之危險因子
D. 此症較常發生於男性

正確答案：D. 此症較常發生於男性